Clinical trial exclusion criterion:
high likelihood of poor adherence to PREP and clinic attendance

Annotated entities:
- Post-eligibility: "high likelihood of poor adherence to PREP and clinic attendanc"